Clinical trial inclusion criterion:
No signs of incomplete abortion

Entity relations:
- Has_negation("signs of incomplete abortion", "No")